「知情同意」（informed consent）不須符合那一原則？
A. 病人的精神能力須能做自我抉擇
B. 病人必須已被適當正確的告知
C. 此決定必須是沒有明顯風險的
D. 此決定必須是病人自願的

正確答案：C. 此決定必須是沒有明顯風險的